Clinical trial exclusion criterion:
Patients with any other severe concurrent disease, which in the judgment of the investigator, would make the patient inappropriate for entry into this study.

Annotated entities:
- Qualifier: "severe"
- Condition: "concurrent disease"
- Non-query-able: "which in the judgment of the investigator,"
- Observation: "entry into this study"
- Mood: "inappropriate for"